一位 30 歲之初產婦懷孕 35 週時因高血壓（170/120 mmHg）及蛋白尿（3.1 g/24 hours）住院，住院時合理的藥物處方應包含：
A. 給予Aspirin
B. 給予MgSO4及降血壓藥物
C. 給予MgSO4、降血壓藥物及抗生素
D. 給予MgSO4、降血壓藥物及低劑量Aspirin

正確答案：B. 給予MgSO4及降血壓藥物